Clinical trial exclusion criterion:
Fructose intolerance, glucose-galactose malabsorption or sucrose-isomaltase insufficiency.

Entity relations:
- OR("Fructose intolerance", "glucose-galactose malabsorption", "sucrose-isomaltase insufficiency")